Subject is ≥ 18 years of age

The above is a clinical trial inclusion criterion. Annotated with entity spans:
Subject is [Value: ≥ 18 years] of [Person: age]